Clinical trial exclusion criterion:
Other protocol-defined inclusion/exclusion criteria may apply

Annotated entities:
- Qualifier: "Other"
- Qualifier: "protocol-defined"
- Non-representable: "Other protocol-defined inclusion/exclusion criteria may apply"